Clinical trial inclusion criterion:
Born at University of New Mexico Hospital

Annotated entities:
- Visit: "University of New Mexico Hospital"
- Person: "Born"